下課時兩個小學生互相拿	筆比劃玩耍，一不小心跌倒在一起，其中一位的筆戳到另一位的眼睛，刺入眼中造成傷口，為何傷者住院後卻出現雙眼同時腫脹，連未受傷眼睛也有炎症情況？
A. 醫療失誤之後感染造成
B. 眼睛是免疫特殊部位（immunologically privileged sites），組織破裂，釋放傷害因子，進而影響到另一未受傷眼睛
C. 眼睛是免疫特殊部位，組織破裂釋出本身抗原時，引起免疫反應，進行攻擊破壞另一未受傷眼睛（sympathetic ophthalmia）
D. 受傷眼睛內產生調節型T淋巴球（Treg cells），將免疫反應導向另一未受傷眼睛

正確答案：C. 眼睛是免疫特殊部位，組織破裂釋出本身抗原時，引起免疫反應，進行攻擊破壞另一未受傷眼睛（sympathetic ophthalmia）